Pregnant woman whose ultrasonographic examination reveals congenital anomaly of the fetus

The above is a clinical trial exclusion criterion. Annotated with entity spans:
[Condition: Pregnant] [Person: woman] whose [Procedure: ultrasonographic examination] reveals [Value: congenital anomaly of the fetus]